Clinical trial inclusion criterion:
Treatment of the current flare with Pentasa® to induce a remission initiated by the patient, the general practitioner or the gastroenterologist, during the inclusion visit or during the week before the inclusion visit.

Entity relations:
- AND("Treatment", "Pentasa")
- AND("flare", "Treatment")
- Has_index("during the inclusion visit", "inclusion visit")
- Has_index("during the week before the inclusion visit", "the week before the inclusion visit")
- Has_temporal("Treatment", "during the inclusion visit")
- OR("during the inclusion visit", "during the week before the inclusion visit")